Clinical trial exclusion criterion:
Abnormal liver function (AST/ALT > x3 upper normal limit)

Annotated entities:
- Measurement: "liver function"
- Value: "Abnormal"
- Measurement: "AST/ALT"
- Value: "> x3 upper normal limit"